Se activa cuando se le une AMP cíclico la:
1. Adenilato ciclasa.
2. Proteína quinasa A.
3. Glucógeno fosforilasa quinasa.
4. Piruvato quinasa.
5. Fosfofructo quinasa 1.

Respuesta correcta: 2. Proteína quinasa A.